下列那一種病毒會以反轉錄酶（reverse transcriptase）複製病毒基因體？
A. 乳突瘤病毒（papillomavirus）
B. 西尼羅河病毒（West Nile virus）
C. B型肝炎病毒（hepatitis B virus）
D. 呼吸道細胞融合病毒（respiratory syncytial virus）

正確答案：C. B型肝炎病毒（hepatitis B virus）